Clinical trial exclusion criteria:
Patients ASA III y IV
Chronic pain history
Drug and alcohol abuse
Chronic use of opioid and sedatives
Neuropsychiatric illness
NSAID and other analgesics used the 48 hours previous to the surgery
CMI > 30

Annotated entities:
- Measurement: "ASA"
- Value: "III y IV"
- Condition: "Chronic pain"
- Condition: "Drug abuse"
- Condition: "alcohol abuse"
- Drug: "opioid"
- Drug: "sedatives"
- Multiplier: "Chronic use"
- Condition: "Neuropsychiatric illness"
- Drug: "NSAID"
- Qualifier: "other"
- Drug: "analgesics"
- Temporal: "48 hours previous to the surgery"
- Reference_point: "the surgery"
- Measurement: "CMI"
- Value: "> 3"